history of drug use or alcool abuse in the last 12 months

The above is a clinical trial exclusion criterion. Annotated with entity spans:
history of [Condition: drug use] or [Condition: alcool abuse] in the [Temporal: last 12 months]